Which human chromosome is the product of fusion?

The evolution of African great ape subtelomeric heterochromatin and the fusion of human chromosome 2.